Clinical trial exclusion criterion:
Severe acute illness as defined by Pitt bacteraemia score of >4

Annotated entities:
- Measurement: "Pitt bacteraemia score"
- Value: ">4"